Clinical trial inclusion criteria:
ASA (American Society of Anesthesiologists) class 1 & 2,
undergoing day-case knee arthroscopy

Annotated entities:
- Measurement: "ASA"
- Value: "class 1 & 2"
- Procedure: "knee arthroscopy"